Clinical trial inclusion criterion:
ASA 1 or2.

Entity relations:
- Has_value("ASA", "1 or2")